Clinical trial exclusion criterion:
Abnormalities of laboratory values: alanine-aminotransferase (ALAT), aspartate-aminotransferase (ASAT), gamma-glutamyl transferase (gammaGT), alkalic phosphatase (AP), bilirubin, amylase, lipase, cystatin C, creatinine, white blood cell count, haemoglobin, platelet count, prothrombin time, aPTT, fibrinogen, thrombin time, factors II,V,VII and X

Entity relations:
- Subsumes("alanine-aminotransferase", "ALAT")
- Subsumes("aspartate-aminotransferase", "ASAT")
- Subsumes("gamma-glutamyl transferase", "gammaGT")
- Subsumes("alkalic phosphatase", "AP")
- Has_value("alanine-aminotransferase", "Abnormalities")
- Has_value("white blood cell count", "Abnormalities")
- OR("alanine-aminotransferase", "aspartate-aminotransferase", "gamma-glutamyl transferase", "factors II", "factors VII", "factors X", "factors V", "thrombin time", "fibrinogen", "aPTT", "prothrombin time,", "platelet count", "haemoglobin", "alkalic phosphatase", "bilirubin", "amylase", "lipase", "cystatin C", "creatinine")